Clinical trial exclusion criterion:
Richter's syndrome, Burkitt's lymphoma, or Burkitt-like Lymphoma (transformed DLBCL from Follicular NHL are eligible).

Entity relations:
- OR("Richter's syndrome", "DLBCL", "Burkitt-like Lymphoma", "Burkitt's lymphoma", "Follicular NHL")